Insufficient response to pregabalin in the treatment of partial seizure, or patients currently receiving pregabalin treatment.

The above is a clinical trial exclusion criterion. Annotated with entity spans:
[Observation: Insufficient response] to [Drug: pregabalin] in the treatment of [Condition: partial seizure], or patients currently receiving [Drug: pregabalin] treatment.